Clinical trial inclusion criterion:
At least 3 urgency episodes per 3-day diary.

Annotated entities:
- Condition: "urgency episodes"
- Multiplier: "At least 3 per 3-day diary."